Clinical trial exclusion criterion:
Treatment with immunosuppressants (e.g. cyclosporine and tacrolimus)

Entity relations:
- Subsumes("immunosuppressants", "cyclosporine")
- OR("cyclosporine", "tacrolimus")